一位接近停經婦女抱怨陰道不正常出血，子宮內膜切片結果為複雜性子宮內膜增生無細胞核異型（ complex hyperplasia without cytologic atypia）。則下列何者為最適當的治療？
A. 觀察
B. 植物性雌激素治療
C. 黃體素治療
D. 子宮切除

正確答案：C. 黃體素治療